Clinical trial exclusion criterion:
Patients who have Tacrolimus trough level resulted as 2 ng/mg at the baseline.

Annotated entities:
- Measurement: "Tacrolimus"
- Value: "2 ng/mg"